Clinical trial inclusion criterion:
Have RA, as defined by the 1987 revised American College of Rheumatology criteria

Annotated entities:
- Condition: "RA"
- Qualifier: "1987 revised American College of Rheumatology criteria"